Clinical trial inclusion criterion:
Living in the Waya Clinic Catchment Area

Annotated entities:
- Visit: "Waya Clinic Catchment Area"
- Person: "Living"